Preference for one of the treatment options

The above is a clinical trial exclusion criterion. Annotated with entity spans:
[Non-representable: Preference for one of the treatment options]